Wolff-Chaikoff effect 是指：
A. 碘離子攝取過量造成甲狀腺素合成減少
B. 碘離子攝取過量造成甲狀腺素合成增加
C. 甲狀腺素過多造成促甲狀腺素（TSH）分泌減少
D. 促甲狀腺素刺激甲狀腺素分泌增加

正確答案：A. 碘離子攝取過量造成甲狀腺素合成減少